Clinical trial exclusion criteria:
not a regular user of e-cigarettes
pregnant or lactating (only excluded from imaging study)
prisoner
incapable of giving informed consent
unable to lie flat on the scanner for extended periods of time
unstable medical condition like heart disease, uncontrolled hypertension, thyroid disease, diabetes, renal or liver impairment, or glaucoma
prostatic hypertrophy, stroke, or ulcer in past year
psychiatric conditions such as schizophrenia, adult ADHD, or bipolar disorder
current or regular use of psychiatric medications such as tranquilizers, antipsychotics, and/or antidepressants
use of medications that are inducers of CYP2A6 (a nicotine metabolizing enzyme) such as rifampicin, dexamethasone, phenobarbital, and other anti-convulsant drugs
unable to communicate in English
current use of smokeless tobacco, tobacco cigarettes (5 and fewer a day)
occasional use of pipes is permitted if subject abstains for the week prior to the study
older than 80 years

Annotated entities:
- Person: "regular user"
- Procedure: "e-cigarettes"
- Negation: "not"
- Pregnancy_considerations: "pregnant or lactating (only excluded from imaging study)"
- Person: "prisoner"
- Post-eligibility: "incapable of giving informed consent"
- Post-eligibility: "unable to lie flat on the scanner for extended periods of time"
- Qualifier: "unstable"
- Condition: "medical condition"
- Condition: "heart disease"
- Condition: "hypertension"
- Qualifier: "uncontrolled"
- Condition: "thyroid disease"
- Condition: "diabetes"
- Condition: "liver impairment"
- Condition: "renal impairment"
- Condition: "glaucoma"
- Condition: "prostatic hypertrophy"
- Condition: "stroke"
- Condition: "ulcer"
- Condition: "psychiatric conditions"
- Condition: "schizophrenia"
- Condition: "adult ADHD"
- Condition: "bipolar disorder"
- Drug: "psychiatric medications"
- Drug: "tranquilizers"
- Drug: "antipsychotics"
- Drug: "antidepressants"
- Drug: "medications"
- Qualifier: "inducers of CYP2A6"
- Drug: "nicotine metabolizing enzyme"
- Drug: "rifampicin"
- Drug: "dexamethasone"
- Drug: "phenobarbital"
- Drug: "anti-convulsant drugs"
- Non-query-able: "unable to communicate in English"
- Procedure: "smokeless tobacco"
- Procedure: "tobacco cigarettes"
- Multiplier: "5 and fewer a day"
- Non-query-able: "ccasional use of pipes is permitted if subject abstains for the week prior to the study"
- Person: "years"
- Value: "older than 80"